病人大腦有病灶，發生 Kernohan 切跡（Kernohan's notch），導致病灶同側輕偏癱（hemiparesis），與之直接相關的變化為何？
A. 大腦鎌下脫出（subfalcial herniation）
B. 經小腦天幕脫出（transtentorial herniation）
C. 小腦扁桃體脫出（tonsillar herniation）
D. 杜雷特氏出血（Duret's hemorrhage）

正確答案：B. 經小腦天幕脫出（transtentorial herniation）